Clinical trial exclusion criterion:
Systemic corticotherapy or immunosuppressive treatment during the previous month, or local corticoid treatment the week before the patch testing.

Annotated entities:
- Procedure: "Systemic corticotherapy"
- Procedure: "immunosuppressive treatment"
- Temporal: "during the previous month"
- Procedure: "local corticoid treatment"
- Temporal: "the week before"